Clinical trial exclusion criterion:
Evidence of current uncontrolled cardiovascular conditions, including uncontrolled hypertension, uncontrolled cardiac arrhythmias, symptomatic congestive heart failure, unstable angina, or myocardial infarction within the past 6 months.

Entity relations:
- Has_temporal("myocardial infarction", "within the past 6 months")
- Has_qualifier("hypertension", "uncontrolled")
- Has_qualifier("cardiac arrhythmias", "uncontrolled")
- Has_qualifier("congestive heart failure", "symptomatic")
- Has_qualifier("cardiovascular conditions", "uncontrolled")
- Has_temporal("cardiovascular conditions", "current")
- Subsumes("cardiovascular conditions", "hypertension")
- OR("hypertension", "cardiac arrhythmias", "myocardial infarction", "unstable angina", "congestive heart failure")